Clinical trial inclusion criteria:
1. Individuals scheduled for undergoing colonoscopy at the Endoscopy Center of Wuxi people's Hospital in China
2. Greater than the age of 18
3. Individuals living with other family members
4. Outpatients

Annotated entities:
- Visit: "Endoscopy Center of Wuxi people's Hospital in China"
- Procedure: "colonoscopy"
- Non-query-able: "scheduled for undergoing"
- Parsing_Error: "1."
- Parsing_Error: "2."
- Value: "Greater than 18"
- Person: "age"
- Parsing_Error: "3."
- Non-query-able: "Individuals living with other family members"
- Parsing_Error: "4."
- Visit: "Outpatients"